Clinical trial exclusion criterion:
1. Uncorrected congenital systemic-to-pulmonary shunt.

Entity relations:
- Has_qualifier("congenital systemic-to-pulmonary shunt", "Uncorrected")